Clinical trial exclusion criterion:
Substantial suicidality in a patient requiring admission but refuses to do so, and signs an "against medical advice" release form as part of clinical evaluation, and does not answer the terms for involuntary admission.

Annotated entities:
- Condition: "suicidality"
- Qualifier: "Substantial"
- Procedure: "admission"
- Non-representable: "signs an "against medical advice" release form as part of clinical evaluation, and does not answer the terms for involuntary admission"